Clinical trial exclusion criterion:
7. Evidence of significant hepatic, hematologic, or immunologic impairment.

Annotated entities:
- Condition: "hepatic impairment"
- Condition: "immunologic impairment"
- Condition: "hematologic impairment"